¿Qué caracteriza a la lactato deshidrogenasa en la fermentación láctica?:
1. Tener como sustrato el Acetil-CoA.
2. Liberar CO2.
3. Consumir NADH y producir NAD+.
4. Permitir que continúe la glucolisis en condiciones aerobias.

Respuesta correcta: 3. Consumir NADH y producir NAD+.